Clinical trial exclusion criteria:
History or presence of any clinically significant disease or disorder
Any condition or disease that would render the subject unsuitable for the study, place the subject at undue risk or interfere with the ability of the subject to complete the study in the opinion of the investigator
History of clinically significant hypersensitivity or allergic drug reactions
Any suspicion or history of alcohol abuse and/or consumption of other drugs of abuse
Regular smoker (> 5 cigarettes, > 1 pipeful or > 1 cigar per day)
Positive for hepatitis B, hepatitis C or HIV infection
Dietary restrictions that would prohibit the consumption of standardized meals
Participation in an investigational drug or device study within 90 days prior to screening, as calculated from the follow-up from the previous study

Annotated entities:
- Qualifier: "clinically significant"
- Condition: "clinically significant disease"
- Condition: "clinically significant disorder"
- Undefined_semantics: "clinically significant disease or disorder"
- Subjective_judgement: "clinically significant disease or disorder"
- Temporal: "History"
- Subjective_judgement: "Any condition or disease that would render the subject unsuitable for the study, place the subject at undue risk or interfere with the ability of the subject to complete the study in the opinion of the investigator"
- Post-eligibility: "Any condition or disease that would render the subject unsuitable for the study, place the subject at undue risk or interfere with the ability of the subject to complete the study in the opinion of the investigator"
- Qualifier: "clinically significant"
- Subjective_judgement: "clinically significant"
- Condition: "hypersensitivity"
- Condition: "allergic drug reactions"
- Condition: "alcohol abuse"
- Observation: "suspicion"
- Temporal: "history"
- Condition: "consumption of other drugs of abuse"
- Condition: "Regular smoker"
- Multiplier: "> 5"
- Observation: "cigarettes"
- Multiplier: "> 1 per day"
- Observation: "cigar"
- Multiplier: "> 1"
- Observation: "pipeful"
- Measurement: "hepatitis B"
- Value: "Positive"
- Measurement: "hepatitis C"
- Condition: "HIV infection"
- Condition: "Dietary restrictions"
- Qualifier: "would prohibit the consumption of standardized meals"
- Undefined_semantics: "would prohibit the consumption of standardized meals"
- Subjective_judgement: "would prohibit the consumption of standardized meals"
- Context_Error: "Participation in an investigational drug or device study within 90 days prior to screening, as calculated from the follow-up from the previous study"